Previously enrolled in this study (i.e. patient now at repeat encounter)

The above is a clinical trial exclusion criterion. Annotated with entity spans:
[Temporal: Previously] [Observation: enrolled in this study] (i.e. patient now at repeat encounter)